Any change in psychotropic medication (including change in dosage) between screening and baseline;

The above is a clinical trial exclusion criterion. Annotated with entity spans:
Any change in [Procedure: psychotropic medication] (including change in dosage) between screening and baseline;